下列有關 electrical burns 之敘述，何者錯誤？
A. 電流在進入身體後，會走在身體組織中電阻最低的部分，通常是神經、血管和肌肉
B. 皮膚是一個電阻相對高的器官，通常較少受到影響
C. 高壓電電傷與一般的燒傷很類似，較少穿透到深部組織造成傷害
D. 肌肉受傷可能會造成橫紋肌溶解，釋放 myoglobin 造成 obstructive nephropathy

正確答案：C. 高壓電電傷與一般的燒傷很類似，較少穿透到深部組織造成傷害